Analizando diversas DNA polimerasas participantes en la replicación de E. coli, se encontró una de ellas que presentaba baja procesividad y baja velocidad de síntesis, ¿de qué enzima se podría tratar?:
1. DNA pol I.
2. DNA B.
3. DNA pol III.
4. Primasa.
5. DNA girasa.

Respuesta correcta: 1. DNA pol I.